Clinical trial inclusion criterion:
A sufficient understood

Annotated entities:
- Non-representable: "A sufficient understood"